Clinical trial exclusion criterion:
Systemic or inhaled corticosteroids.

Annotated entities:
- Drug: "inhaled corticosteroids"
- Drug: "Systemic corticosteroids"
- Qualifier: "Systemic"
- Qualifier: "inhaled"